下列關於關節炎分類的鑑別診斷中，何種組合最正確？
A. tuberculous arthritis－acute monoarticular arthritis
B. virus-induced arthritis－chronic monoarticular arthritis
C. sarcoidosis－chronic polyarticular arthritis
D. infectious arthritis－acute polyarticular arthritis

正確答案：C. sarcoidosis－chronic polyarticular arthritis